Paciente de 58 años diagnosticado de leucemia mieloide crónica. El tratamiento más indicado sería:
1. Interferón.
2. Hidroxiurea.
3. Imatinib.
4. Rituximab.
5. Busulfan.

Respuesta correcta: 3. Imatinib.